控制干擾因子，在研究設計階段，可採下列那個方法？
A. 廻歸分析
B. 配對
C. 分層分析
D. 隨機抽樣

正確答案：B. 配對